Patients needed to pericardiocentesis during RFCA for paroxysmal or persistent atrial fibrillation.

The above is a clinical trial inclusion criterion. Annotated with entity spans:
Patients needed to [Procedure: pericardiocentesis] [Temporal: during RFCA] for [Qualifier: paroxysmal] or [Qualifier: persistent] [Condition: atrial fibrillation].